下列有關superior mesenteric artery（SMA）syndrome的敘述，何者錯誤？
A. 又名Wilkie's syndrome
B. 指duodenum 3rd portion被SMA壓迫
C. 較易發生於年輕女性
D. 較易發生於肥胖者

正確答案：D. 較易發生於肥胖者